Clinical trial exclusion criterion:
Uncontrolled anxiety, schizophrenia, or other psychiatric disorder that, in the opinion of the investigator, may interfere with study assessments or compliance

Entity relations:
- OR("anxiety", "schizophrenia", "psychiatric disorder")